一名三十七歲男性，遭車禍導致大量失血休克，送至開刀房進行止血，麻醉醫師處理病人時，除了麻醉深度之外，下列何者也必須一併考慮？①腸道系統很容易受到休克的影響，產生「no-reflow」現象，為多重器官系統衰竭（MOSF：multiple organ system failure）的重要一環 ②腎臟在休克初期仍能保持腎絲球過濾率 （GFR：glomerular filtration rate），但血流會傾向分佈至表層皮質區域（superficial cortical area） ③肺部
 可能出現急性呼吸窘迫症候（ARDS：acute respiratory distress syndrome），主要源自於炎性反應而不是出血反應 ④給予足夠的麻醉深度，收縮壓維持70～100 mmHg為目標即可，進行輸液治療
A. ①③④
B. ①②④
C. ②③④
D. ①②③

正確答案：A. ①③④